下列何種藥物是甲醇（methanol）中毒時的最佳解毒劑？
A. hydroxocobalamin
B. fomepizole
C. esmolol
D. pralidoxime

正確答案：B. fomepizole